Can provide informed consent form expressing willingness to participate in the study and comply with follow-up tests and evaluation procedures.

The above is a clinical trial inclusion criterion. Annotated with entity spans:
[Post-eligibility: Can provide informed consent form expressing willingness to participate in the study and comply with follow-up tests and evaluation procedures.]